Clinically significant laboratory abnormalities

The above is a clinical trial exclusion criterion. Annotated with entity spans:
[Qualifier: Clinically significant] [Condition: laboratory abnormalities]